Clinical trial exclusion criterion:
Organic diseases of the digestive system (gastro-oesophageal reflux disease (GERD), ulcer, chronic pancreatitis, cholelithiasis, fatty liver disease, hepatitis, cirrhosis of liver, etc.) .

Annotated entities:
- Condition: "Organic diseases"
- Qualifier: "digestive system"
- Condition: "gastro-oesophageal reflux disease (GERD)"
- Condition: "ulcer"
- Condition: "chronic pancreatitis"
- Condition: "cholelithiasis"
- Condition: "fatty liver disease"
- Condition: "hepatitis"
- Condition: "cirrhosis of liver"